Patient must meet 1987 ACR criteria

The above is a clinical trial inclusion criterion. Annotated with entity spans:
Patient must meet [Condition: 1987 ACR criteria]